Clinical trial exclusion criterion:
previous spine fusion surgery

Annotated entities:
- Procedure: "spine fusion surgery"
- Temporal: "previous"